Clinical trial exclusion criterion:
Severe bruxism or clenching habits

Annotated entities:
- Observation: "clenching habits"
- Observation: "bruxism"